Francisco es un niño afecto de fenilcetonuria, enfermedad autosómico recesiva debida a mutaciones del gen de la fenilalanina hidroxilasa. ¿Qué posibilidades tienen sus padres de tener otro hijo afecto de dicha enfermedad?
1. Un 50% independientemente del sexo de los hijos.
2. Un 25% independientemente del sexo de los hijos.
3. Un 50% de los niños y un 25% de las niñas.
4. Un 50% de las niñas y un 25 % de los niños.

Respuesta correcta: 2. Un 25% independientemente del sexo de los hijos.